4. The Principal Investigator deems any clinical laboratory test (at the Screening Visit) abnormality to be clinically significant

The above is a clinical trial exclusion criterion. Annotated with entity spans:
4. [Subjective_judgement: The Principal Investigator deems any clinical laboratory test (at the Screening Visit) abnormality to be clinically significant]